Clinical trial inclusion criterion:
men and women 30-55 years with BMI 30-40 and waist 95 cm or more

Annotated entities:
- Person: "men"
- Person: "women"
- Value: "30-55 years"
- Measurement: "BMI"
- Value: "30-40"
- Measurement: "waist"
- Value: "95 cm or more"
- Person: "30-55 years"